Clinical trial inclusion criterion:
Able to communicate well with the investigators

Annotated entities:
- Non-query-able: "Able to communicate well with the investigators"